Clinical trial exclusion criterion:
Use of any investigational or non-registered product (drug or vaccine) other than the study vaccine(s) within 30 days preceding the first dose of study vaccine, or planned use during the study period

Annotated entities:
- Drug: "product any investigational other than the study vaccine(s)"
- Drug: "non-registered product any other than the study vaccine(s)"
- Drug: "drug"
- Drug: "vaccine"
- Temporal: "within 30 days"
- Mood: "planned use"
- Temporal: "during the study period"